Current use of serotonin-precursors (such as L-tryptophan, oxitriptan)

The above is a clinical trial exclusion criterion. Annotated with entity spans:
Current use of [Drug: serotonin-precursors] (such as [Drug: L-tryptophan], [Drug: oxitriptan])